Contraindication to progestin-only contraceptives

The above is a clinical trial exclusion criterion. Annotated with entity spans:
[Non-query-able: Contraindication] to [Drug: progestin]-[Qualifier: only] [Procedure: contraceptives]